Clinical trial exclusion criterion:
Baseline systolic blood pressure (SBP) < 100 mmHg

Entity relations:
- Subsumes("systolic blood pressure", "SBP")
- Has_value("systolic blood pressure", "< 100 mmHg")
- Has_temporal("systolic blood pressure", "Baseline")